Patients must have adequate renal function as documented by a calculated creatinine clearance ≥ 60.

The above is a clinical trial inclusion criterion. Annotated with entity spans:
Patients must have [Value: adequate] [Measurement: renal function] as documented by a [Measurement: calculated creatinine clearance] [Value: ≥ 60].